¿Qué procedimiento específico de la estrategia experimental hace que sea la más adecuada para contrastar hipótesis de causalidad? :
1. El muestreo representativo de los participantes.
2. La manipulación de la variable independiente con control de las posibles variables extrañas.
3. La realización del estudio en contextos reales con grupos naturales.
4. La identificación de posibles variables predictoras a través del análisis retrospectivo del fenómeno de estudio.
5. La aplicación de técnicas estadísticas para el análisis de los datos.

Respuesta correcta: 2. La manipulación de la variable independiente con control de las posibles variables extrañas.